Clinical trial inclusion criteria:
Aged over 18
Primary symptom of chest pain
No contraindication to CTA
Willing and able to provide written informed consent

Annotated entities:
- Person: "Aged"
- Value: "over 18"
- Condition: "chest pain"
- Qualifier: "Primary symptom"
- Procedure: "CTA"
- Condition: "contraindication"
- Negation: "No"
- Informed_consent: "Willing and able to provide written informed consent"